Clinical trial inclusion criterion:
=19 years of age

Annotated entities:
- Person: "age"
- Value: "=19 years"